The patients are undergoing current administration of anti-cancer therapies, or are attending other clinical trials.

The above is a clinical trial exclusion criterion. Annotated with entity spans:
The patients are undergoing current administration of [Procedure: anti-cancer therapies], or are [Observation: attending other clinical trials].